Clinical trial exclusion criterion:
Subjects with a history of significant metabolic, cardiac, congestive heart failure, cerebrovascular, hematological, pulmonary, gastrointestinal, liver, renal, or endocrine disease or cancer that in the investigator's opinion would interfere with or alter the outcome measures, or impact subject safety.

Annotated entities:
- Temporal: "history"
- Qualifier: "significant"
- Qualifier: "metabolic"
- Qualifier: "cardiac"
- Condition: "congestive heart failure"
- Qualifier: "cerebrovascular"
- Qualifier: "hematological"
- Qualifier: "pulmonary"
- Qualifier: "gastrointestinal"
- Qualifier: "liver"
- Qualifier: "renal"
- Qualifier: "endocrine"
- Condition: "disease"
- Condition: "cancer"
- Non-query-able: "that in the investigator's opinion would interfere with or alter the outcome measures, or impact subject safety."